Clinical trial inclusion criterion:
a radiographically confirmed hip fracture

Entity relations:
- AND("radiographically", "hip fracture")